Clinical trial inclusion criterion:
Has a HLA-B27+ gene and 2 or more of the SpA characteristics listed above

Entity relations:
- Has_multiplier("SpA", "2 or more")